7. Patients who have had HSCT and are within 100 days of transplant and/or are still taking immunosuppressive drugs and/or have clinically significant graft-versus-host disease requiring treatment and/or have >Grade 1 persistent non hematological toxicity related to the transplant

The above is a clinical trial exclusion criterion. Annotated with entity spans:
7. Patients who [Temporal: have had] [Condition: HSCT] and are [Temporal: within 100 days of transplant] and/or are [Temporal: still] taking [Drug: immunosuppressive drugs] and/or have [Qualifier: clinically significant] [Condition: graft-versus-host disease] [Mood: requiring] [Procedure: treatment] and/or have [Qualifier: >Grade 1] [Qualifier: persistent] [Qualifier: non hematological] [Condition: toxicity] related to the [Procedure: transplant]